de Quervain disease為那一個手腕背側伸肌腱腔室的狹窄性腱鞘炎？
A. 第一個
B. 第二個
C. 第三個
D. 第五個

正確答案：A. 第一個